T follicular helper（TFH）細胞對於體液免疫反應（humoral immune response）非常重要，關於TFH的描述何者錯誤？
A. TFH細胞位在germinal center的淺色區（light zone）
B. TFH細胞的分化需要Bcl-6轉錄因子
C. TFH細胞可以分泌IL-21和其他的細胞激素，IL-21促進漿細胞分化
D. 小鼠B細胞在體外培養時利用加入LPS、IL-2、及IL-21，可以替代TFH細胞功能來刺激IgG1抗體產生

正確答案：D. 小鼠B細胞在體外培養時利用加入LPS、IL-2、及IL-21，可以替代TFH細胞功能來刺激IgG1抗體產生